What promotes amyloid-peptide beta 42 (Aβ42) accumulation in neuroblastoma cells?

The amyloid-peptide beta 42 (Aβ42) accumulates in neuroblastoma cells due to a protein called apoE4-165, which is an apolipoprotein (APOE4). This protein is the most common protein responsible for late-onset Alzheimer disease.